La anafase A se caracteriza por el acortamiento de los microtúbulos:
1. Cinetocóricos.
2. Polares.
3. Interpolares.
4. Astrales.
5. Longitudinales.

Respuesta correcta: 1. Cinetocóricos.